Antihypertensives (<3 medications on a stable dose for ≥ 30 days);

The above is a clinical trial exclusion criterion. Annotated with entity spans:
[Drug: Antihypertensives] ([Multiplier: <3 medications] on a [Qualifier: stable dose] [Temporal: for ≥ 30 days]);